Hyperhydration

The above is a clinical trial inclusion criterion. Annotated with entity spans:
[Condition: Hyperhydration]